一位 35 歲健康女性，最近一星期牙疼、發燒，早上起床時，頭痛、嘔吐，突然出現複視、右眼結膜水腫和突出，下列敘述何者錯誤？
A. 儘快安排腦部核磁共振造影檢查
B. 積極抗生素治療
C. 不宜使用抗凝血劑治療
D. 有併發腦出血之可能

正確答案：C. 不宜使用抗凝血劑治療